Clinical trial exclusion criterion:
Allergy to amide local anesthetics (lidocaine, bupivacaine, ropivacaine) or opioid (fentanyl).

Annotated entities:
- Condition: "Allergy"
- Drug: "amide local anesthetics"
- Drug: "lidocaine"
- Drug: "bupivacaine"
- Drug: "ropivacaine"
- Drug: "opioid"
- Drug: "fentanyl"